Clinical trial exclusion criterion:
History of blood clotting or bleeding abnormalities

Annotated entities:
- Condition: "bleeding abnormalities"
- Condition: "blood clotting abnormalities"